Clinical trial exclusion criterion:
Known uncontrolled systemic illness (uncontrolled diabetes, human immunodeficiency virus, vasculitis, autoimmune/inflammatory disease)

Entity relations:
- Has_qualifier("systemic illness", "uncontrolled")
- Has_qualifier("diabetes", "uncontrolled")
- Subsumes("systemic illness", "diabetes")
- OR("diabetes", "human immunodeficiency virus", "vasculitis", "autoimmune", "inflammatory disease")